What is FeatureCounts used for?

We present featureCounts, a read summarization program suitable for counting reads generated from either RNA or genomic DNA sequencing experiments.